Clinical trial exclusion criterion:
Intracardiac mass, tumor, or thrombus

Entity relations:
- OR("Intracardiac mass", "tumor", "thrombus")